Clinical trial inclusion criterion:
Urine cotinine level ? 100 ng/ml (NicAlert(r) reading ? 3)

Entity relations:
- Has_value("Urine cotinine level", "? 100 ng/ml")
- Has_value("NicAlert(r)", "? 3")
- Subsumes("Urine cotinine level", "NicAlert(r)")